Clinical trial exclusion criterion:
Patients on life support or in a critical care unit.

Annotated entities:
- Procedure: "life support"
- Visit: "critical care unit"